El Sr. T. T. de 92 años, ingresado en la unidad de hospitalización recientemente, ha comenzado con diferentes síntomas que hacen sospechar que presenta un síndrome confusional agudo. Dentro de las medidas de prevención y cuidados para este problema está indicado:
1. Aconsejar a la familia que no deje de estimular permanentemente al paciente.
2. Utilizar la contención física en todos estos pacientes para evitar caídas.
3. Evitar juntar dos pacientes con este problema en la misma habitación.
4. Retirar las prótesis dentales, auditivas y visuales para prevenir lesiones.
5. Evitar cualquier tipo de iluminación nocturna en la habitación para favorecer el descanso.

Respuesta correcta: 3. Evitar juntar dos pacientes con este problema en la misma habitación.